Subjects who have used any drugs or substances known to inhibit or induce cytochrome (CYP) P450 enzymes and/or P-glycoprotein (P-gp) within 28 days prior to the first dose and throughout the study

The above is a clinical trial exclusion criterion. Annotated with entity spans:
Subjects who have used any [Drug: drugs] or substances known to inhibit or induce cytochrome (CYP) P450 enzymes and/or P-glycoprotein (P-gp) [Temporal: within 28 days prior to the first dose] and [Temporal: throughout the study]